patient belonging to another health sector in the Community of Madrid or other community

The above is a clinical trial exclusion criterion. Annotated with entity spans:
[Non-query-able: patient belonging to another health sector in the Community of Madrid or other community]